Clinical trial exclusion criterion:
Total bilirubin level exceeded 2 mg / dL

Annotated entities:
- Measurement: "Total bilirubin level"
- Value: "exceeded 2 mg / dL"